比較血管系統中，動脈、微血管與靜脈等組織的結構與功能，下列敘述何者正確？
A. 動脈富彈性，所以其順應性（compliance）比靜脈好
B. 平時約有60%血液停留在靜脈。所以靜脈是血管系統的「壓力儲存器」（pressure reservoir）
C. 微血管有最大的總橫切面積與最低平均流速
D. 血液在不同血管中的流速取決於距離心臟的遠近

正確答案：C. 微血管有最大的總橫切面積與最低平均流速